甲型血友病（hemophilia A）病童未治療時，下列何種偵測結果為真？
A. 白血球趨化作用（chemotaxis）異常
B. hypoxanthine guanine phosphoribosyltransferase 缺乏
C. 第九因子缺乏（factor IX deficiency）
D. 活化凝血酵素時間（partial thromboplastin time, PTT）延長

正確答案：D. 活化凝血酵素時間（partial thromboplastin time, PTT）延長